HB = 90g / L

The above is a clinical trial inclusion criterion. Annotated with entity spans:
[Measurement: HB] [Value: = 90g / L]